Esophageal varices with high bleeding risk: more than F2 and red color sign

The above is a clinical trial inclusion criterion. Annotated with entity spans:
[Condition: Esophageal varices] with [Observation: high bleeding risk]: [Multiplier: more than] [Measurement: F2] and [Condition: red color sign]